Clinical trial exclusion criterion:
Patients that are prisoners

Annotated entities:
- Person: "prisoners"